Clinical trial inclusion criterion:
Men and women 35 to 70 years of age

Entity relations:
- Has_value("age", "35 to 70 years")
- OR("Men", "women")